關於子宮內膜增生（endometrial hyperplasia），一般認為與下列何種基因最有關？
A. PTEN
B. BRCA1
C. HER2
D. BRCA2

正確答案：A. PTEN